Clinical trial exclusion criterion:
Primary substance exposure in-utero was buprenorphine, or was not opioids

Entity relations:
- Has_qualifier("substance exposure", "in-utero")
- Has_qualifier("substance exposure", "buprenorphine")
- Has_negation("opioids", "not")